Clinical trial inclusion criterion:
Males or non-pregnant, non-nursing females

Annotated entities:
- Person: "Males"
- Negation: "non-"
- Condition: "pregnant"
- Negation: "non-"
- Observation: "nursing"
- Person: "females"